Clinical trial exclusion criterion:
Coagulation disorders

Annotated entities:
- Condition: "Coagulation disorders"